Clinical trial inclusion criterion:
Caucasian male or female patient

Annotated entities:
- Person: "Caucasian"
- Person: "male"
- Person: "female"